發生在嬰兒及小孩的畸胎瘤（Teratoma），以那一位置最多？
A. 睪丸
B. 卵巢
C. 薦尾骨區域
D. 中隔腔

正確答案：C. 薦尾骨區域